5. Multivessel disease with at least one significant stenosis in LAD and with treatment of the lesion in another major epicardial coronary artery. A two-vessel disease or a three-vessel disease may be viewed as a combination of a side branch and a main epicardial vessel provided they supply different territories; left anterior descending, left circumflex and right coronary artery);

The above is a clinical trial inclusion criterion. Annotated with entity spans:
5. [Condition: Multivessel disease] with [Value: at least one] [Condition: significant stenosis in LAD] and with [Procedure: treatment of the lesion] [Qualifier: in another major epicardial coronary artery]. [Non-representable: A two-vessel disease or a three-vessel disease may be viewed as a combination of a side branch and a main epicardial vessel provided they supply different territories; left anterior descending, left circumflex and right coronary artery);]